Acetaminophen allergy or already receiving acetaminophen within 24 h of surgery

The above is a clinical trial exclusion criterion. Annotated with entity spans:
[Drug: Acetaminophen] [Condition: allergy] or already receiving [Drug: acetaminophen] [Temporal: within 24 h of surgery]